High-risk for VTE

The above is a clinical trial inclusion criterion. Annotated with entity spans:
[Mood: High-risk] for [Condition: VTE]